For subjects enrolled at Indian sites: Moderate or severe acute illness/infection (according to investigator judgment) on the day of vaccination or febrile illness (temperature ≥ 38.0°C).

The above is a clinical trial exclusion criterion. Annotated with entity spans:
For subjects enrolled at [Visit: Indian sites]: [Qualifier: Moderate] or [Qualifier: severe] [Condition: acute illness]/infection ([Subjective_judgement: according to investigator judgment]) [Temporal: on the day of vaccination] or [Condition: febrile illness] ([Measurement: temperature] [Value: ≥ 38.0°C]).